Clinical trial exclusion criterion:
Severe renal dysfunction (eGFR=30 ml/min/1.73m2).

Entity relations:
- Has_qualifier("renal dysfunction", "Severe")
- Has_value("eGFR", "=30 ml/min/1.73m2")
- Subsumes("renal dysfunction", "eGFR")